Subjects aged 12-65.

The above is a clinical trial inclusion criterion. Annotated with entity spans:
Subjects [Person: aged] [Value: 12-65].